Clinical trial inclusion criterion:
BMI 20 - 35 kg/m2

Annotated entities:
- Measurement: "BMI"
- Value: "20 - 35 kg/m2"